下列的何種全身性血管炎會有氣喘病的發作？
A. Churg-Strauss syndrome
B. Goodpasture's syndrome
C. essential mixed cryoglobulinemia
D. drug-induced vasculitis

正確答案：A. Churg-Strauss syndrome